在糖蛋白質（glycoproteins）中，下列何組胺基酸直接參與糖與蛋白質共價鍵的形成？
A. 甘胺酸、蘇氨酸和絲氨酸（Gly, Thr & Ser）
B. 天門冬醯胺、蘇氨酸和絲氨酸（Asn, Thr & Ser）
C. 麩胺醯胺、絲氨酸和酪氨酸（Gln, Ser & Tyr）
D. 離胺酸、組織胺酸和麩胺酸（Lys, His & Glu）

正確答案：B. 天門冬醯胺、蘇氨酸和絲氨酸（Asn, Thr & Ser）